下列 nonsteroidal anti-inflammatory drugs（NSAID），何者不適合用於痛風之治療？
A. Indomethacin
B. Aspirin
C. Naproxen
D. Ibuprofen

正確答案：B. Aspirin